Clinical trial exclusion criterion:
Psychiatric diseases; Severe endocrinopathies;

Entity relations:
- Has_qualifier("endocrinopathies", "Severe")